Clinical trial inclusion criterion:
Patient with spontaneous intracranial hemorrhage or traumatic intracranial hemorrhage or patient requiring neurological surgery

Entity relations:
- Has_mood("neurological surgery", "requiring")
- OR("spontaneous intracranial hemorrhage", "traumatic intracranial hemorrhage", "neurological surgery")